腦中風病人在臥床擺位上，長時間側躺（side lying）最常發生壓瘡（pressure sore）的位置在下列何部位？
A. 腳跟（heel）
B. 肩峰（acromion）
C. 股骨大粗隆（greater trochanter）
D. 腸骨突（iliac crest）

正確答案：C. 股骨大粗隆（greater trochanter）